De acuerdo con la regla del extremo Nterminal, el residuo N-terminal de una proteína determina:
1. Su tasa de plegamiento.
2. Su concentración intracelular.
3. Su localización intracelular.
4. Su vida media.
5. Su tasa de traducción.

Respuesta correcta: 4. Su vida media.